Patient planned for or has had a revascularization procedure in the affected leg within the last 8 weeks

The above is a clinical trial exclusion criterion. Annotated with entity spans:
Patient [Mood: planned] for or [Observation: has had] a [Procedure: revascularization procedure] in the [Reference_point: affected leg] [Temporal: within the last 8 weeks]